Clinical trial exclusion criterion:
With acute diseases, such as acute phase after myocardial infarction (within 3 months), within 3 months after acute heart failure or new cerebral infarction;

Annotated entities:
- Condition: "acute diseases"
- Temporal: "acute phase"
- Condition: "myocardial infarction"
- Temporal: "within 3 months"
- Temporal: "within 3 months"
- Condition: "acute heart failure"
- Condition: "cerebral infarction"